Clinical trial inclusion criterion:
Pediatric patients with deep dental decay in primary molars

Entity relations:
- Has_qualifier("deep dental decay", "primary molars")